組織胺 histamine H1-受體拮抗劑可以用來治療下列疾病，何者除外？
A. 暈車、暈船
B. 過敏性鼻炎
C. 蕁麻疹
D. 胃潰瘍

正確答案：D. 胃潰瘍